Los factores de transcripción:
1. Se unen a la cromatina por interacción con la histona H2A.
2. Se unen al RNA y regulan el inicio de la transcripción.
3. Se unen al DNA.
4. Se organizan en nucleosomas.
5. Regulan la mutilación del DNA.

Respuesta correcta: 3. Se unen al DNA.